Clinical trial exclusion criterion:
2. History of disabling neurological or psychiatric condition such as epilepsy (besides posttraumatic epilepsy), multiple sclerosis, cortical stroke, hypoxic-ischemic encephalopathy, encephalitis, or schizophrenia

Annotated entities:
- Temporal: "History"
- Condition: "condition disabling neurological"
- Condition: "psychiatric condition disabling"
- Condition: "epilepsy"
- Condition: "posttraumatic epilepsy"
- Negation: "besides"
- Condition: "multiple sclerosis"
- Condition: "cortical stroke"
- Condition: "hypoxic-ischemic encephalopathy"
- Condition: "encephalitis"
- Condition: "schizophrenia"
- Undefined_semantics: "disabling neurological or psychiatric condition"